Clinical trial exclusion criterion:
Presence of major contraindications to magnetic resonance imaging (cardiac pacemakers, claustrophobia, foreign bodies and implanted medical devices with ferromagnetic properties).

Annotated entities:
- Procedure: "magnetic resonance imaging"
- Observation: "major contraindications"
- Device: "cardiac pacemakers"
- Condition: "claustrophobia"
- Observation: "foreign bodies"
- Device: "implanted medical devices"
- Qualifier: "ferromagnetic properties"